Signs of hemodynamic instability (i.e. systolic blood pressure <100 mm Hg.St. or episode of systolic blood pressure fall for =40 mm Hg. / or heart rate > 110 lasting more than 15 min) or need for ventilatory support within 12 hours prior to randomisation.

The above is a clinical trial exclusion criterion. Annotated with entity spans:
Signs of [Condition: hemodynamic instability] (i.e. [Measurement: systolic blood pressure] [Value: <100 mm Hg.St.] or episode of [Measurement: systolic blood pressure fall] for [Value: =40 mm Hg]. / or [Measurement: heart rate] [Value: > 110] [Multiplier: lasting more than 15 min]) or [Mood: need for] [Procedure: ventilatory support] [Temporal: within 12 hours prior to randomisation].